Clinical trial exclusion criterion:
History of multiple myeloma

Annotated entities:
- Condition: "multiple myeloma"
- Temporal: "History"